強迫症（obsessive-compulsive disorder）患者最常見之共病精神疾患為下列何者？
A. 抽搐症（tic disorder）
B. 妥瑞氏症候群（Tourette's syndrome）
C. 重度憂鬱症（major depressive disorder）
D. 酒精濫用（alcohol abuse）

正確答案：C. 重度憂鬱症（major depressive disorder）